Clinical trial exclusion criterion:
a history of arrhythmia, bronchial and cardiovascular diseases, abnormal liver function and so on

Annotated entities:
- Condition: "arrhythmia"
- Temporal: "history"
- Condition: "bronchial diseases"
- Condition: "cardiovascular diseases"
- Condition: "abnormal liver function"